Which is the primary interacting protein of BLK?

Primary interacting protein of BLK (also known as BANK1)